當病人有下列何種臨床症狀時，麻醉誘導給予的 thiopental 不必減量？
A. 低血容積休克（hypovolemic shock）
B. 血清白蛋白（serum albumin）濃度下降
C. 血酸中毒（acidosis）
D. 血鹼中毒（alkalosis）

正確答案：D. 血鹼中毒（alkalosis）